Hemoglobin less than 7.0 gms even if receiving erythropoietin.

The above is a clinical trial exclusion criterion. Annotated with entity spans:
[Measurement: Hemoglobin] [Value: less than 7.0 gms] [Qualifier: even if receiving erythropoietin].